aged less than 20 years

The above is a clinical trial exclusion criterion. Annotated with entity spans:
[Person: aged] [Value: less than 20 years]